下列何者不是第三對腦神經麻痺可能引起的徵候？
A. 內斜視
B. 外斜視
C. 瞳孔變大
D. 眼瞼下垂

正確答案：A. 內斜視